Left main disease

The above is a clinical trial exclusion criterion. Annotated with entity spans:
[Condition: Left main disease]